Clinical trial exclusion criterion:
Clinically relevant findings(e.g. blood pressure, electrocardiogram(ECG); physical and gynecological examination, laboratory examination)

Entity relations:
- Has_qualifier("findings", "Clinically relevant")
- Subsumes("findings", "blood pressure")
- OR("blood pressure", "physical examination", "gynecological examination", "electrocardiogram(ECG)", "laboratory examination")